Clinical trial exclusion criterion:
have sleep apnea, or are shift workers

Annotated entities:
- Condition: "sleep apnea"
- Person: "shift workers"